Clinical trial inclusion criterion:
Presence of sustained ventricular tachycardia with HR> 120 bpm

Entity relations:
- Has_value("HR", "> 120 bpm")
- Has_qualifier("ventricular tachycardia", "sustained")
- AND("ventricular tachycardia", "HR")